一位 50 歲長期抽菸的男性民眾到您的診所要戒菸。除了行為諮商外，下列那些藥品可以用來幫助他克服尼古丁戒斷症候？①nicotine patch ②nicotine gum ③lorazepam（Ativan） ④bupropion SR（Zyban）
A. ①②③
B. ①②④
C. ①③④
D. ②③④

正確答案：B. ①②④